¿Cuál de las siguientes estructuras es más anterior?:
1. Tráquea.
2. Esófago.
3. Columna vertebral.
4. Vena cava superior.

Respuesta correcta: 4. Vena cava superior.